Clinical trial inclusion criterion:
resection should be more than two months,

Entity relations:
- Has_temporal("resection", "more than two months")